Clinical trial exclusion criterion:
Less than 30 yrs of age or > 65 yrs of age

Entity relations:
- Has_value("age", "> 65 yrs")
- Has_value("age", "Less than 30 yrs")